腹部腔室症候群（abdominal compartment syndrome）是指腹腔內臟器出血或腹內組織水腫，造成腹內壓（intra-abdominal pressure）急遽上升，導致呼吸困難、血壓下降、腎臟衰竭時，應立即採用下列何種方法處理為佳？
A. 插氣管內管
B. 使用增壓劑（vasopressor）
C. 施打利尿劑（diuretic agents）
D. 立即採用減壓處置或手術（decompressive procedures or operation）

正確答案：D. 立即採用減壓處置或手術（decompressive procedures or operation）